Clinical trial exclusion criterion:
Current or previous history of analgesic dependence

Entity relations:
- Has_temporal("history", "Current")
- multi("analgesic dependence", "analgesic")
- Has_temporal("analgesic dependence", "history")
- OR("Current", "previous")